一位85歲女性病人兩年前中風臥床，現身上有鼻胃管及導尿管，兩年中曾有三次因吸入性肺炎住進加護病房，下列有關居家訪視服務的描述，何者最不適當？
A. 討論有關末期狀況時所要作的處理
B. 協助病人更換鼻胃管及導尿管
C. 評估家屬之照顧能力
D. 若有發燒馬上送醫院，以免肺炎的惡化

正確答案：D. 若有發燒馬上送醫院，以免肺炎的惡化